如果要將上述的研究結果應用在臨床診療或社區醫療上，下列何者是最具有臨床意義的參考變項？
A. 實驗組與對照組兩組間的個案數
B. 實驗組與對照組兩組間在跌倒比例之統計差異的 P 值
C. 相對於對照組，實驗組發生跌倒的相對危險性
D. 實驗組與對照組發生跌倒的絕對危險差

正確答案：D. 實驗組與對照組發生跌倒的絕對危險差